腎衰竭病人洗腎七年後血清檢查鈣約 10.2 mg/dL，副甲狀腺素 1300 pg/mL，則最可能的診斷為何？
A. 原發性副甲狀腺機能亢進，副甲狀腺腫瘤（adenoma）
B. 原發性副甲狀腺機能亢進，副甲狀腺增生（hyperplasia）
C. 次發性（secondary）副甲狀腺機能亢進
D. 三次性（tertiary）副甲狀腺增生

正確答案：C. 次發性（secondary）副甲狀腺機能亢進